History of severe psychiatric disease, especially depression. Severe psychiatric disease is defined as major depression or psychosis, a period of treatment with an antidepressant medication or major tranquilizer at therapeutic doses for depression or psychosis for at least 3 months, a suicidal attempt, hospitalization for psychiatric disease, or a period of disability due to a psychiatric disease.

The above is a clinical trial exclusion criterion. Annotated with entity spans:
History of [Qualifier: severe] [Condition: psychiatric disease], especially [Condition: depression]. [Qualifier: Severe] [Condition: psychiatric disease] is defined as [Condition: major depression] or [Condition: psychosis], a period of [Procedure: treatment] with an [Drug: antidepressant medication] or [Drug: major tranquilizer] at [Multiplier: therapeutic doses] for [Condition: depression] or [Condition: psychosis] [Temporal: for at least 3 months], a [Condition: suicidal attempt], [Procedure: hospitalization] for [Condition: psychiatric disease], or a period of [Condition: disability] due to a [Condition: psychiatric disease].